What disease is associated with a Malar rash?

the cutaneous effects of sle are frequently the presenting symptoms. typically noted in the classic malar "butterfly " rash